Psychiatric patients already diagnosed of schizophrenia or bipolar disorder, according to the Diagnostic and Statistical Manual of Mental Disorders- IV, Diagnostic and Statistical Manual of Mental Disorders- V or International Code of Disease criteria.

The above is a clinical trial inclusion criterion. Annotated with entity spans:
Psychiatric patients already diagnosed of [Condition: schizophrenia] or [Condition: bipolar disorder], according to the [Measurement: Diagnostic and Statistical Manual of Mental Disorders- IV], [Measurement: Diagnostic and Statistical Manual of Mental Disorders- V] or [Measurement: International Code of Disease criteria].